Clinical trial inclusion criterion:
Clinical diagnosis of a Grade I or II ankle sprain

Entity relations:
- Has_qualifier("ankle sprain", "Grade I")
- OR("Grade I", "Grade II")